從長期追蹤術後併發症及死亡率而言，下列何種二尖瓣手術方式結果最好？
A. 二尖瓣再造術（Mitral valve reconstruction）
B. 機械性瓣膜置換術
C. 豬心瓣膜置換術
D. 牛心瓣膜置換術

正確答案：A. 二尖瓣再造術（Mitral valve reconstruction）